Clinical trial exclusion criterion:
Patients who currently fulfil criteria for DSM-IV eating disorder, body dysmorphic disorder, current alcohol or substance abuse, or who have a lifetime history of bipolar disorder. Patients with a history of Schizophrenia and other psychotic disorders, Delirium, Dementia, and Amnestic and other cognitive disorders.

Annotated entities:
- Condition: "eating disorder"
- Condition: "body dysmorphic disorder"
- Condition: "substance abuse"
- Condition: "alcohol abuse"
- Condition: "bipolar disorder"
- Condition: "Schizophrenia"
- Condition: "psychotic disorders"
- Qualifier: "other"
- Condition: "Delirium"
- Condition: "Dementia"
- Condition: "Amnestic"
- Condition: "cognitive disorders"
- Qualifier: "other"
- Qualifier: "DSM-IV"